逆行性射精（retrograde ejaculation）的病理變化是：
A. 無法達到性高潮
B. 射精的收縮力道不夠
C. 膀胱頸無法收縮或關閉
D. 精液量不夠導致無法由尿道排出

正確答案：C. 膀胱頸無法收縮或關閉